List features of the DEND syndrome.

Clinical features of the DEND syndrome include developmental delay, epilepsy and neonatal diabetes.